Clinical trial inclusion criterion:
Type of subject: outpatient.

Annotated entities:
- Visit: "outpatient"